Clinical trial inclusion criterion:
Patient in sepsis and colistin was administered empirically to increase antibiotic coverage.

Entity relations:
- AND("administered empirically", "colistin")